Clinical trial exclusion criterion:
2. Screening tools: MRI safety screening questionnaire, Medical history, Medical Assessments: Urine toxicology analyzes for presence of a broad range of prescription and nonprescription drugs.

Annotated entities:
- Parsing_Error: "2."
- Procedure: "Screening"
- Procedure: "MRI safety screening questionnaire"
- Procedure: "MRI"
- Procedure: "safety screening questionnaire"
- Procedure: "Medical history"
- Procedure: "Urine toxicology analyzes"
- Qualifier: "prescription"
- Qualifier: "nonprescription"
- Drug: "drugs"